La estimulación de los cuerpos carotídeos:
1. Disminuye el pH de la sangre arterial.
2. Disminuye la PCO2 en sangre arterial.
3. Aumenta la concentración arterial de bicarbonato.
4. Aumenta la excreción urinaria de sodio.
5. Disminuye la presión arterial.

Respuesta correcta: 2. Disminuye la PCO2 en sangre arterial.